下列何者之蟲卵可隨血液循環到腦或脊髓，形成肉芽腫，引起癲癇、神經缺陷？
A. 棘口吸蟲（Echinostoma spp.）
B. 異形吸蟲（Heterophyes heterophyes）
C. 牛羊肝吸蟲（Fasciola hepatica）
D. 薑片蟲（Fasciolopsis buski）

正確答案：B. 異形吸蟲（Heterophyes heterophyes）